previous history of roux-en-y gastric bypass

The above is a clinical trial exclusion criterion. Annotated with entity spans:
[Temporal: previous] [Temporal: history] of [Procedure: roux-en-y gastric bypass]